En el caso más general, la función de onda de un sistema mecanocuántico:
1. Se define para cada electrón y sólo depende de las coordenadas de ese electrón.
2. Depende de las coordenadas espaciales de todas las partículas que forman el sistema y del tiempo.
3. Nunca depende del tiempo.
4. Se encuentra como solución a las ecuaciones del movimiento propuestas por Newton.
5. Siempre se puede descomponer en suma de ecuaciones para cada una de las partículas que forman el sistema.

Respuesta correcta: 2. Depende de las coordenadas espaciales de todas las partículas que forman el sistema y del tiempo.